Type I or II diabetes mellitus.

The above is a clinical trial inclusion criterion. Annotated with entity spans:
[Condition: Type I] or II diabetes mellitus.